生長很快速的惡性骨骼腫瘤，經常：
A. 引發骨膜形成大量反應性骨骼
B. 出現骨髓腔內骨骼增生
C. 引起病理性骨折
D. 須施行截肢治療

正確答案：C. 引起病理性骨折